As of 2019, what type of cancer is commonly associated with ionizing radiation

By contrast, osteosarcoma may be caused by external or internal ionizing radiation,